Clinical trial inclusion criterion:
TPN cholestasis of at least 2.5 mg/dl

Annotated entities:
- Condition: "TPN cholestasis"
- Multiplier: "at least 2.5 mg/dl"